Clinical trial exclusion criterion:
Evidence of possible liver damage defined by an aspartate transaminase (AST) level that is more than 3x the upper limit of normal in an asymptomatic patient

Entity relations:
- Subsumes("aspartate transaminase", "AST")
- AND("liver damage", "aspartate transaminase")
- Has_value("aspartate transaminase", "more than 3x the upper limit of normal")